Which algorithm has been developed for prediction of protein subcellular localization using deep learning?

DeepLoc is an algorithm which has been developed for prediction of protein subcellular localization using deep learning.